Clinical trial inclusion criteria:
planned sequential both-sided lower third molar extraction (split-mouth) with osteotomy (with or without upper molar extraction in local anesthesia)
able to understand the study and the NRS scale

Annotated entities:
- Mood: "planned"
- Qualifier: "sequential"
- Qualifier: "both-sided"
- Procedure: "lower third molar extraction"
- Qualifier: "split-mouth"
- Procedure: "osteotomy"
- Procedure: "upper molar extraction"
- Procedure: "local anesthesia"
- Observation: "able to understand the study"
- Non-representable: "and the NRS scale"